Clinical trial exclusion criterion:
3. History of oxygen dependence;

Annotated entities:
- Parsing_Error: "3."
- Condition: "oxygen dependence"
- Temporal: "History"